Clinical trial inclusion criteria:
Patients should have at least 12 teeth present
Patients with Moderate to Advanced Chronic periodontitis
Patients with 2 or more interproximal sites (not on same tooth) with probing pocket depths of 5mm or more and 2 or more interproximal sites (not on same tooth)of probing attachment loss of 4mm or more which bled on probing.

Annotated entities:
- Condition: "teeth present"
- Multiplier: "at least 12"
- Condition: "Chronic periodontitis"
- Qualifier: "Advanced"
- Qualifier: "Moderate"
- Multiplier: "2 or more"
- Condition: "interproximal sites with probing pocket depths of 5mm or more"
- Value: "5mm or more"
- Multiplier: "2 or more"
- Condition: "interproximal sites of probing attachment loss of 4mm or more"
- Value: "4mm or more"
- Qualifier: "bled on probing"
- Procedure: "probing"